催產素（oxytocin）是由下列何種細胞分泌？
A. 下視丘神經元
B. 垂體細胞（pituicyte）
C. 垂體嗜鹼性細胞
D. 垂體嗜酸性細胞

正確答案：A. 下視丘神經元